hepatic insufficiency (three times the upper limit of normal (ULN) for aspartate aminotransferase (AST) and/or alanine aminotransferase (ALT)); liver transplant recipient; cirrhosis of the liver;

The above is a clinical trial exclusion criterion. Annotated with entity spans:
[Condition: hepatic insufficiency] ([Value: three times the upper limit of normal] (ULN) for [Measurement: aspartate aminotransferase] ([Measurement: AST]) and/or [Measurement: alanine aminotransferase] ([Measurement: ALT])); [Procedure: liver transplant] recipient; [Condition: cirrhosis of the liver];